一位病患因為兩側下肢水腫而求診，身體檢查發現頸靜脈的壓力約為 12 cmH2O，則下列何種致病原因的可能性最低？
A. 肝硬化（liver cirrhosis）
B. 心臟衰竭（heart failure）
C. 腎衰竭（renal failure）
D. 侷限性心包膜炎（constrictive pericarditis）

正確答案：A. 肝硬化（liver cirrhosis）